Clinical trial exclusion criterion:
Uncontrolled Type II diabetes mellitus (Hemaglobin subtype A1C (HbA1C) >11 %)

Annotated entities:
- Condition: "Type II diabetes mellitus"
- Measurement: "Hemaglobin subtype A1C (HbA1C)"
- Value: ">11 %"
- Qualifier: "Uncontrolled"